Clinical trial exclusion criterion:
cauda equina or conus lesion

Annotated entities:
- Qualifier: "cauda equina"
- Qualifier: "conus"
- Condition: "lesion"